Clinical trial exclusion criterion:
1. Comorbidity with other severe or chronic eye conditions that in the judgment of the investigator will interfere with study assessments, such as corneal opacities and scars, dystrophies, epithelial scarring, infections, blood clots, etc.

Annotated entities:
- Parsing_Error: "1."
- Subjective_judgement: "in the judgment of the investigator"
- Non-query-able: "will interfere with study assessments"
- Context_Error: "will interfere with study assessments"
- Condition: "corneal opacities"
- Condition: "corneal scars"
- Condition: "dystrophies"
- Condition: "epithelial scarring"
- Condition: "infections"
- Condition: "blood clots"
- Condition: "eye conditions"
- Qualifier: "will interfere with study assessments"